Where is the yeast transpozable element Ty3 preferentially inserted?

The retrovirus-like element Ty3 of Saccharomyces cerevisiae integrates at the transcription initiation region of RNA polymerase III genes and is preferentially inserted in transfer RNA genes.